Clinical trial inclusion criterion:
American Society of Anesthesiologists Physical Status Classification (ASA) 1-2

Annotated entities:
- Measurement: "American Society of Anesthesiologists Physical Status Classification"
- Measurement: "ASA"
- Value: "1-2"